Clinical trial exclusion criterion:
History of autoimmune hepatitis

Entity relations:
- Has_temporal("autoimmune hepatitis", "History")